遲發性運動困難（Tardive dyskinesia）一般係由下列那一種原因所造成？
A. 去極化（Depolarization）所導致邊緣系統（Mesolimbic system）多巴胺（Dopamine）神經元被抑制
B. 多巴胺受體過度敏感性（Supersensitivity）
C. 藥物阻斷乙醯膽鹼系統的活性
D. 阻斷血清素（Serotonin）受體

正確答案：B. 多巴胺受體過度敏感性（Supersensitivity）